Patients who have received wide field radiotherapy ≤ 4 weeks or limited field radiation for palliation < 2 weeks prior to screening or who have not recovered adequately from side effects of such therapy.

The above is a clinical trial exclusion criterion. Annotated with entity spans:
Patients who have received [Procedure: wide field radiotherapy] [Temporal: ≤ 4 weeks] or [Procedure: limited field radiation for palliation] [Temporal: < 2 weeks prior to screening] or who have [Negation: not] [Condition: recovered] [Qualifier: adequately] from [Condition: side effects of such therapy].